Un paciente acude a consulta por malestar general y coloración amarillenta de la piel y su médico sospecha que se trata de un cuadro de hepatitis A. ¿Cuál de las siguientes respuestas constituye el factor que de forma más exacta y segura permite determinar la probabilidad preprueba (antes de realizar ningún estudio) de que se trate de dicho cuadro?
1. Intensidad de la ictericia.
2. Frecuencia de la hepatitis A en el entorno.
3. Días de duración del cuadro.
4. Experiencia del profesional sobre cuadros de ictericia.
5. Enfermedades previas del paciente.

Respuesta correcta: 2. Frecuencia de la hepatitis A en el entorno.